Left ventricular ejection fraction (LVEF) less than 40% by echocardiography during screening and randomization.

The above is a clinical trial inclusion criterion. Annotated with entity spans:
[Measurement: Left ventricular ejection fraction (LVEF)] [Value: less than 40%] by [Procedure: echocardiography] [Temporal: during screening and randomization].